Clinical trial exclusion criterion:
Incompletely cured pre-existing diseases for which it can be assumed that the absorption, distribution, metabolism, elimination or effects of the study drugs will not be normal

Annotated entities:
- Condition: "pre-existing diseases"
- Qualifier: "Incompletely cured"
- Subjective_judgement: "can be assumed"
- Non-query-able: "Incompletely cured pre-existing diseases for which it can be assumed that the absorption, distribution, metabolism, elimination or effects of the study drugs will not be normal"